最常見的原發性腦瘤是：
A. 動脈瘤
B. 腦下垂體腫瘤
C. 神經膠質瘤
D. 聽神經瘤

正確答案：C. 神經膠質瘤